一位籃球選手可以帶球跑步上籃，但在跳投時臏骨（patella）下緣會有疼痛現象，下列那種疾病是最可能的診斷？
A. 前十	韌帶（anterior cruciate ligament）斷裂
B. 膝骨性關節炎（osteoarthritis）
C. 內側半月型軟骨（meniscus）破裂
D. 膝肌腱炎（patellar tendinitis）

正確答案：D. 膝肌腱炎（patellar tendinitis）